untreated thyroid pathology

The above is a clinical trial exclusion criterion. Annotated with entity spans:
[Qualifier: untreated] [Condition: thyroid pathology]